Rheumatic conditions (Rheumatoid arthritis, lupus, and any other autoimmune disease the -PI deems them to be ineligible for)

The above is a clinical trial exclusion criterion. Annotated with entity spans:
[Condition: Rheumatic conditions] ([Condition: Rheumatoid arthritis], [Condition: lupus], and any other [Condition: autoimmune disease] the -PI deems them to be ineligible for)